Interaction of WDR5 with which gene has a critical role in pancreatic cancer?

Interaction of WDR5 with WDR4 and c-Myc is critical for the development of pancreatic cancer.